一位 72 歲男性病人，因便血 4 天住院，住院當天仍解 4 次紅色血便。住院時血壓 100/74 mmHg，脈搏每分鐘 74 次。抽血檢查白血球 8,100/mm3，血紅素為 11.6 g/dL，血小板 260,000/mm3。下列何者為此病人住院後最好之下一步檢查？
A. 腹部血管攝影
B. 鋇劑大腸 X 光檢查
C. 大腸鏡檢查
D. 放射性紅血球掃描

正確答案：C. 大腸鏡檢查